Knowingly affected by HIV or Hepatitis.

The above is a clinical trial exclusion criterion. Annotated with entity spans:
Knowingly affected by [Condition: HIV] or [Condition: Hepatitis].